Has untreated active Hepatitis B

The above is a clinical trial exclusion criterion. Annotated with entity spans:
Has [Qualifier: untreated] [Qualifier: active] [Condition: Hepatitis B]